Clinical trial inclusion criterion:
Current use of standard antidepressant treatment in monotherapy or combination of 2 antidepressants : escitalopram (10 - 20mg/d), fluoxetine(20 - 40mg/d), paroxetine CR(25 - 50mg/d), sertraline(100 - 150mg/d), mirtazapine (15 - 45mg/d), duloxetine (30 - 60mg/d) or venlafaxine ER(150-225mg/d)

Entity relations:
- Has_qualifier("antidepressant", "standard")
- Has_qualifier("antidepressant", "monotherapy")
- Has_multiplier("antidepressants", "2")
- Has_multiplier("escitalopram", "10 - 20mg/d")
- Has_multiplier("fluoxetine", "20 - 40mg/d")
- Has_multiplier("paroxetine CR", "25 - 50mg/d")
- Has_multiplier("sertraline", "100 - 150mg/d")
- Has_multiplier("mirtazapine", "15 - 45mg/d")
- Has_multiplier("duloxetine", "30 - 60mg/d")
- Has_multiplier("venlafaxine ER", "150-225mg/d")
- Subsumes("antidepressant", "escitalopram")
- OR("antidepressant", "antidepressants")